病人為一名 37 歲，懷孕 22 週之婦女（之前剖腹產 2 次），因有早產現象住進一家大型的醫學中心安胎。經醫師診斷為雙胞胎妊娠及雙胞胎間輸血症候群、羊水過多、子宮早期收縮。其間該孕婦接受一系列羊水引流術約有 2 萬 mL 羊水被抽出，孕婦之血色素在 1 個月之間由 10.2 g/dL 降為 7.5 g/dL。醫師判定該孕婦應接受輸血，以防止胎兒子宮內缺氧、改善胎兒心臟衰竭現象，並為接受手術後易併發產後大出血之準備。但該孕婦因為乃耶和華見證人會之信徒，故拒絕接受輸血。雖經醫院醫師、院牧工作人員及社工師基於醫療救人之職責，多次與其溝通，該孕婦仍堅持其不接受輸血之立場。 在這個個案中，那兩個倫理原則互相衝突，而使醫師陷入兩難抉擇？
A. 病人自主原則和公平正義原則
B. 行善原則和不傷害原則
C. 病人自主原則和不傷害原則
D. 行善原則和公平正義原則

正確答案：C. 病人自主原則和不傷害原則